Severe cardiovascular disorder, renal failure, peritonitis, sepsis

The above is a clinical trial exclusion criterion. Annotated with entity spans:
[Qualifier: Severe] [Condition: cardiovascular disorder], [Condition: renal failure], [Condition: peritonitis], [Condition: sepsis]